Clinical trial inclusion criterion:
No more than one HIV-1 plasma RNA greater than or equal to 50 and less than 200 copies/mL (only one "blip") in the past 6 months with a subsequent HIV-1 plasma RNA less than 50 copies/mL. NOTE: There should be no plasma HIV-1 RNA greater than 200 copies/mL within the 6 months prior to study entry.

Annotated entities:
- Multiplier: "No more than one"
- Measurement: "HIV-1 plasma RNA"
- Value: "greater than or equal to 50 and less than 200 copies/mL"
- Temporal: "in the past 6 months"
- Measurement: "HIV-1 plasma RNA"
- Value: "less than 50 copies/mL"
- Temporal: "subsequent"
- Negation: "no"
- Measurement: "plasma HIV-1 RNA"
- Value: "greater than 200 copies/mL"
- Temporal: "within the 6 months prior to study entry"